治療急性躁狂發作時，下列何類藥劑可最迅速控制患者之高度興奮症狀？
A. 情緒穩定劑（mood stablizers）
B. 安眠藥物（hypnotics）
C. 抗精神病藥物（antipsychotics）
D. 抗憂鬱藥物（antidepressants）

正確答案：C. 抗精神病藥物（antipsychotics）